Has a contact lens spherical prescription between + 2.25 to - 8.00 (inclusive)

The above is a clinical trial inclusion criterion. Annotated with entity spans:
Has a [Device: contact lens] [Qualifier: spherical] prescription between [Value: + 2.25 to - 8.00 (inclusive)]